下列何者不屬於紋狀體（corpus striatum）？
A. 尾狀核（caudate nucleus）
B. 殼部（putamen）
C. 黑質（substantia nigra）
D. 蒼白球（globus pallidus）

正確答案：C. 黑質（substantia nigra）